Clinical trial exclusion criterion:
Pregnant or breast-feeding

Entity relations:
- OR("Pregnant", "breast-feeding")